關於 X-linked hypophosphatemic rickets 的敘述，下列何者錯誤？
A. 大多因為 PHEX 基因突變所致
B. 低血鈣
C. 血清 1,25-dihydroxyvitamin D 濃度正常
D. 治療時需同時給予磷酸鹽及 calcitriol

正確答案：B. 低血鈣